Clinical trial exclusion criterion:
congestive heart failure NYHA III-IV

Entity relations:
- Has_value("NYHA", "III-IV")
- AND("congestive heart failure", "NYHA")